Eligible for surgery with curative intent

The above is a clinical trial inclusion criterion. Annotated with entity spans:
Eligible for [Procedure: surgery] with [Qualifier: curative] intent